Clinical trial exclusion criterion:
Are currently imprisoned or in psychiatric hospitalization

Annotated entities:
- Person: "imprisoned"
- Observation: "psychiatric hospitalization"